Clinical trial inclusion criterion:
2. Off antiretroviral therapy (ART) for > 6 weeks before the study and no plans to begin treatment for the study duration. (The decision of whether or not a subject takes antiretroviral therapy will be made by the subject in consultation with his/her primary care provider prior to screening for this study.)

Entity relations:
- multi("Off antiretroviral therapy (ART)", "antiretroviral therapy (ART)")
- Has_index("> 6 weeks before the study", "the study")
- multi("for the study duration", "study")
- Has_temporal("treatment", "for the study duration")
- Has_mood("treatment", "plans to begin")
- Has_negation("plans to begin", "no")
- Has_temporal("Off antiretroviral therapy (ART)", "> 6 weeks before the study")